Clinical trial inclusion criterion:
Subjects must:

Annotated entities:
- Parsing_Error: "Subjects must:"